What is the basis of the methidiumpropyl-EDTA sequencing (MPE-seq) method?

Methidiumpropyl-EDTA sequencing (MPE-seq) is a method for the genome-wide characterization of chromatin that involves the digestion of nuclei withMPE-Fe(II) followed by massively parallel sequencing. MPE-seq unlike MNase-seq cleaves nuclear DNA with little sequence bias and thus provides a unique and straightforward means for the genome-wide analysis of chromatin structure with minimal DNA sequence bias.